Los linfocitos Th1:
1. Producen interferón gamma (IFN-γ).
2. Median las enfermedades alérgicas.
3. Activan a mastocitos.
4. Son muy activos frente a bacterias extracelulares.
5. Reclutan neutrófilos en los lugares de reconocimiento del antígeno.

Respuesta correcta: 1. Producen interferón gamma (IFN-γ).